Clinical trial inclusion criterion:
Male or female = 2 years of age;

Entity relations:
- Has_value("age", "= 2 years")
- OR("Male", "female")